Clinical trial inclusion criterion:
Idiopathic Granulomatous Mastitis

Annotated entities:
- Condition: "Idiopathic Granulomatous Mastitis"